急性呼吸窘迫症候群（acute respiratory distress syndrome；ARDS）以呼吸機進行呼吸支持治療過程，理想潮氣量（tidal volume）之設定建議為多少ml/kg？
A. 6
B. 10
C. 12
D. 15

正確答案：A. 6